Clinical trial exclusion criterion:
Hepatic insufficiency (Child-Pugh score > 5)

Entity relations:
- Has_value("Child-Pugh score", "> 5")
- AND("Hepatic insufficiency", "Child-Pugh score")